Clinical trial inclusion criterion:
Normal hormonal investigation: TSH, PRL, FBS.

Entity relations:
- Subsumes("hormonal investigation:", "TSH")
- Has_value("hormonal investigation:", "Normal")
- Subsumes("hormonal investigation:", "PRL")
- Subsumes("hormonal investigation:", "FBS")